When was Fluzone Intradermal replaced with Fluzone Intradermal Quadrivalent?

Fluzone Intradermal was replaced with Fluzone Intradermal Quadrivalent vaccine in advance of the 2015-2016 season.